Which enzyme is inhibited by a drug Lorlatinib?

Lorlatinib is anaplastic lymphoma kinase inhibitor.